Clinical trial exclusion criterion:
Cholesterol total > 300 mg/dl with or without use of statin;

Entity relations:
- Has_value("Cholesterol total", "> 300 mg/dl")